Woman patients who do not agree to the contraception from baseline to 12 month

The above is a clinical trial exclusion criterion. Annotated with entity spans:
[Pregnancy_considerations: Woman patients who do not agree to the contraception from baseline to 12 month]